¿Cuál de los siguientes NO es un componente del entrenamiento en cama seca para la enuresis?
1. La utilización de la alarma.
2. La práctica positiva.
3. El despertar programado.
4. El reforzamiento positivo.
5. Los ejercicios esfintéricos.

Respuesta correcta: 5. Los ejercicios esfintéricos.